Clinical trial inclusion criterion:
KPS ≥ 60

Annotated entities:
- Measurement: "KPS"
- Value: "≥ 60"